腹膜透析病人發生腹膜炎時一般不會有那個徵象？
A. 渾濁的透析液
B. 腹痛
C. 腹膜透析流出液之白血球數＞100 per microliter
D. 腹膜透析脫水量增加

正確答案：D. 腹膜透析脫水量增加